Clinical trial exclusion criterion:
Severe Iron deficiency anemia (hemoglobin < 8.0 g/dL).

Entity relations:
- Has_value("hemoglobin", "< 8.0 g/dL")
- Has_qualifier("Iron deficiency anemia", "Severe")
- Subsumes("Iron deficiency anemia", "hemoglobin")